有關Lisfranc氏損傷（Lisfranc injury）的敘述，下列何者錯誤？
A. 屬於跗蹠關節損傷（tarso-metatarsal joint injury）
B. Lisfranc氏韌帶位於第二楔狀骨（cuneiform）及第一蹠骨（metatarsus）之間
C. 足部前後相位（anteroposterior view）的 X光檢查，若發現第一和第二蹠骨基底部的距離增大時，須高度懷
D. 足部斜相位（oblique view）的 X光檢查， 若發現第四蹠骨與骰骨（cuboid）內緣不在同一連線，須高度懷

正確答案：B. Lisfranc氏韌帶位於第二楔狀骨（cuneiform）及第一蹠骨（metatarsus）之間